下列那一種抗體在血清中濃度最高？
A. IgA
B. IgE
C. IgG
D. IgM

正確答案：C. IgG